Clinical trial inclusion criterion:
Able to participate in the full 2 years of treatment

Annotated entities:
- Observation: "Able to participate"
- Procedure: "treatment"
- Multiplier: "full 2 years"